正常人呼吸時，下列何者測得的壓力於吸氣期和呼氣期最可能都是負壓（negative pressure）？
A. 肋膜壓（pleural pressure）
B. 肺泡壓（alveolar pressure）
C. 肺泡壓－肋膜壓（transpulmonary pressure）
D. 氣道壓（airway pressure）

正確答案：A. 肋膜壓（pleural pressure）